Clinical trial exclusion criterion:
Presence of arrhythmia (including atrial fibrillation, atrial flutter, or 2nd or 3rd degree atrioventricular block)

Annotated entities:
- Condition: "arrhythmia"
- Condition: "atrial fibrillation"
- Condition: "atrial flutter"
- Condition: "3rd degree atrioventricular block"
- Condition: "2nd degree atrioventricular block"